Myocardial damage, diabetic coma, heart block

The above is a clinical trial exclusion criterion. Annotated with entity spans:
[Condition: Myocardial damage], [Condition: diabetic coma], [Condition: heart block]